Clinical trial exclusion criterion:
Any disorder that compromises the ability of the patient to give written informed consent and/or comply with study procedures

Annotated entities:
- Condition: "disorder"
- Negation: "compromises the ability of"
- Measurement: "give written informed consent"
- Procedure: "comply with study procedures"